Clinical trial exclusion criterion:
Known or suspected HIV, Hepatitis B, or Hepatitis C infection

Annotated entities:
- Condition: "HIV infection"
- Condition: "Hepatitis B infection"
- Condition: "Hepatitis C infection"